Clinical trial inclusion criterion:
Provide written informed consent prior to inclusion.

Entity relations:
- Has_index("prior to inclusion", "inclusion")
- Has_temporal("written informed consent", "prior to inclusion")